Clinical trial exclusion criterion:
Currently or has recently received radiotherapy or chemotherapy, adrenocorticotropic hormone (ACTH), corticosteroids, or immunosuppressive drugs.

Annotated entities:
- Procedure: "radiotherapy"
- Procedure: "chemotherapy"
- Temporal: "recently"
- Drug: "adrenocorticotropic hormone"
- Drug: "ACTH"
- Drug: "corticosteroids"
- Procedure: "immunosuppressive drugs"